Clinical trial inclusion criterion:
Liver Transplant Recipients have received liver transplantations for at least 6+1 months prior to enrollment

Annotated entities:
- Person: "Liver Transplant Recipients"
- Procedure: "liver transplantations"
- Temporal: "for at least 6+1 months prior to enrollment"
- Reference_point: "enrollment"